Patients with bladder outlet obstruction (BOO) that, in the opinion of the study urologist, would expose them to risk of urinary retention during treatment with mirabegron.

The above is a clinical trial exclusion criterion. Annotated with entity spans:
Patients with [Condition: bladder outlet obstruction] ([Condition: BOO]) that, in the opinion of the study urologist, would expose them to [Observation: risk of urinary retention] during treatment with [Drug: mirabegron].